Clinical trial inclusion criterion:
Chronic hepatitis B (HBsAg positive > 6 months)

Entity relations:
- Has_value("HBsAg", "positive")
- Has_temporal("HBsAg", "> 6 months")
- AND("Chronic hepatitis B", "HBsAg")